What is the indication for Truvada?

Truvada is used for HIV pre-exposure prophylaxis (PrEP) in high risk individuals